下列何者會導致高血壓合併低腎素（renin）？
A. 腎動脈高血壓
B. 惡性高血壓
C. 本態性高血壓
D. 原發性皮質醛酮症（Primary aldosteronism）

正確答案：D. 原發性皮質醛酮症（Primary aldosteronism）